Clinical trial exclusion criterion:
Hypotension (Systolic blood pressure <100 mmHg)

Annotated entities:
- Condition: "Hypotension"
- Measurement: "Systolic blood pressure"
- Value: "<100 mmHg"